Must have had a treatment-free interval of greater than 6 months following response to platinum.

The above is a clinical trial inclusion criterion. Annotated with entity spans:
Must have had [Condition: a treatment-free interval] of [Temporal: greater than 6 months following response to platinum].